Which disease is characterized by congenital absence of intrinsic ganglion cells of the gastrointestinal tract?

The medical condition characterized by the congenital absence of intrinsic ganglion cells in the myenteric and submucosal plexuses along variable lengths of the gastrointestinal tract is called aganlionic megacolon or Hirschsprung disease.